Clinical trial exclusion criterion:
Gastrointestinal disease or with gastrointestinal surgical history which can affect the absorption of the investigational product.

Entity relations:
- OR("Gastrointestinal disease", "gastrointestinal surgical history")